右肺門前方的腫瘤最可能壓迫下列何者？
A. 膈神經（phrenic nerve）
B. 迷走神經（vagus nerve）
C. 喉返神經（recurrent laryngeal nerve）
D. 交感神經幹（sympathetic trunk）

正確答案：A. 膈神經（phrenic nerve）